Wilson's disease

The above is a clinical trial exclusion criterion. Annotated with entity spans:
[Condition: Wilson's disease]